Known allergy or intolerance to any of the study medications.

The above is a clinical trial exclusion criterion. Annotated with entity spans:
Known [Condition: allergy] or [Condition: intolerance] to any of the [Drug: study medications].